Female with childbearing potential who has a negative urine pregnancy test result at study start and willing to continue practice appropriate birth control during the entire duration of study

The above is a clinical trial inclusion criterion. Annotated with entity spans:
[Pregnancy_considerations: Female with childbearing potential who has a negative urine pregnancy test result at study start and willing to continue practice appropriate birth control during the entire duration of study]